En relación a la fructosa-2, 6 bifosfato
1. Es un intermedio glicolítico.
2. Es un efector alostérico de la triacilglicerollipasa.
3. Su concentración regula la velocidad de la glicólisis y de la gluconeogénesis.
4. Es el activador más potente del complejo de la piruvato-deshidrogenasa.

Respuesta correcta: 3. Su concentración regula la velocidad de la glicólisis y de la gluconeogénesis.